下列何種靜脈麻醉藥物（intravenous anesthetics）在室溫下打開藥瓶後不易保存，容易有細菌生長，因此在開瓶後六小時內應使用完畢？
A. Thiopental
B. Pentobarbital
C. Propofol
D. Diazepam

正確答案：C. Propofol